針對末期心臟衰竭的病人，在心臟移植之前，尚有其他手術方式可以改善心臟功能及臨床症狀，但下列何者除外？
A. 冠狀動脈繞道手術（coronary artery bypass surgery）
B. 二尖瓣逆流重建手術（mitral reconstruction）
C. 經心肌雷射血管再生術（transmyocardial laser revascularization）
D. 部分左心室心肌切除手術（partial left ventriculectomy）

正確答案：C. 經心肌雷射血管再生術（transmyocardial laser revascularization）